Persistent primary or recurrent trans-sphincteric anal fistula

The above is a clinical trial inclusion criterion. Annotated with entity spans:
Persistent [Multiplier: primary] or [Multiplier: recurrent] [Condition: trans-sphincteric anal fistula]